Clinical trial inclusion criterion:
Patient able to receive neuraxial analgesia

Annotated entities:
- Procedure: "neuraxial analgesia"
- Mood: "able to receive"